乳癌經放射治療或外科手術切除後，最可能發生的肉瘤是：
A. Angiosarcoma
B. Rhabdomyosarcoma
C. Liposarcoma
D. Leiomyosarcoma

正確答案：A. Angiosarcoma